下列關於後縱膈腔的敘述，何者正確？
A. 位於心包後方與胸椎之間
B. 食道在內垂直下行
C. 半奇靜脈在第四胸椎高度跨過脊椎
D. 食道不與縱膈膜直接相接觸

正確答案：A. 位於心包後方與胸椎之間